Medical condition requiring chronic use of high dose systemic corticosteroids (i.e., doses of prednisone higher than 10 mg/day or equivalent). Brief (<15 days) treatment with glucocorticoids (prednisone 100 mg by mouth daily, or equivalent) is acceptable.

The above is a clinical trial exclusion criterion. Annotated with entity spans:
[Condition: Medical condition] requiring [Temporal: chronic] use of [Multiplier: high dose] [Drug: systemic corticosteroids] (i.e., doses of [Drug: prednisone] [Multiplier: higher than 10 mg/day] or equivalent). Brief ([Temporal: <15 days]) treatment with [Drug: glucocorticoids] ([Drug: prednisone] [Multiplier: 100 mg] by mouth daily, or equivalent) [Grammar_Error: is acceptable].